Clinical trial exclusion criterion:
History or current evidence of wasting, autoimmune (such as rheumatoid arthritis and systemic lupus erythematosus) or connective tissue diseases

Annotated entities:
- Temporal: "History"
- Temporal: "current"
- Observation: "wasting"
- Condition: "autoimmune diseases"
- Condition: "rheumatoid arthritis"
- Condition: "systemic lupus erythematosus"
- Condition: "connective tissue diseases"